Clinical trial exclusion criterion:
Known hypersensitivity to egg, soybean proteins, peanut proteins, corn or corn products, or to any of the active substances or excipients

Entity relations:
- AND("hypersensitivity", "egg")
- OR("egg", "corn products", "active substances", "excipients", "peanut proteins", "soybean proteins", "corn")